Un hombre de 38 años acude a urgencias por disnea progresiva y tos seca de una semana de evolución. No tiene antecedentes de interés. Las constantes vitales son: temperatura 37,8ºC, presión arterial 110/70 mmHg, frecuencia cardiaca 105 lpm y frecuencia respiratoria 30 rpm. En la exploración respiratoria destaca matidez a la percusión, disminución del frémito táctil (vocal) y disminución de los ruidos respiratorios en la base del hemitórax derecho. El resto de la exploración física es normal. ¿Cuál es el diagnóstico más probable?
1. Derrame pleural.
2. Neumonía lobar.
3. Bronquitis aguda.
4. Tuberculosis pulmonar.
5. Neumotórax.

Respuesta correcta: 1. Derrame pleural.